Clinical trial exclusion criterion:
Less than two months treatment of adjunctive medications AND less than one month on same dose: beta blockers, antidepressants, mood stabilizers, antianxiety medications.

Annotated entities:
- Multiplier: "Less than two months"
- Procedure: "treatment"
- Drug: "adjunctive medications"
- Multiplier: "less than one month"
- Multiplier: "same dose"
- Drug: "beta blockers"
- Drug: "antidepressants"
- Drug: "mood stabilizers"
- Drug: "antianxiety medications"